Clinical trial inclusion criterion:
elective thoracotomy

Annotated entities:
- Procedure: "thoracotomy"
- Qualifier: "elective"